Clinical trial inclusion criterion:
Provision of signed and dated informed consent form

Annotated entities:
- Post-eligibility: "Provision of signed and dated informed consent form"